Clinical trial inclusion criterion:
Subjects must have failed at least two previous chemotherapy regimens. Paclitaxel must have been a component of one or both regimens and cisplatin or carboplatin must have been a component of one or both regimens.

Entity relations:
- Has_temporal("chemotherapy regimens", "previous")
- AND("at least two", "chemotherapy regimens")
- Has_context("chemotherapy regimens", "failed")
- AND("chemotherapy regimens", "Paclitaxel")
- AND("chemotherapy regimens", "cisplatin")
- OR("cisplatin", "carboplatin")